Clinical trial inclusion criterion:
Subject motivated to seek treatment for erectile dysfunction.

Annotated entities:
- Condition: "erectile dysfunction"
- Procedure: "treatment"
- Post-eligibility: "Subject motivated to seek treatment for erectile dysfunction"